Clinical trial inclusion criterion:
Have chronic kidney disease with GFR <50

Entity relations:
- Has_value("GFR", "<50")
- AND("chronic kidney disease", "GFR")